下列有關過敏性休克（anaphylaxis）的敘述，何者錯誤？
A. 只有注射藥物或昆蟲叮咬才會產生
B. 是經由過敏原與肥胖細胞（mast cell）上的 IgE 抗體結合所導致
C. 儘快給病人施打 epinephrine，可緩解大部分症狀
D. 盤尼西林（penicillin）過敏者，若打頭孢子菌素（cephalosporin）仍有部分病患可能過敏

正確答案：A. 只有注射藥物或昆蟲叮咬才會產生